Clinical trial inclusion criterion:
Able to give consent

Annotated entities:
- Non-query-able: "Able to give consent"